Clinical trial exclusion criterion:
Subjects who had a serious adverse events during stem cell therapy

Entity relations:
- Has_index("during", "stem cell therapy")
- Has_temporal("serious adverse events", "during")